Clinical trial inclusion criterion:
Adult kidney transplant recipients > 18 y.o.

Entity relations:
- Has_value("y.o.", "> 18")